Clinical trial exclusion criterion:
Patients with concomitant HIV infection or congenital immune deficiency diseases.

Entity relations:
- Has_qualifier("HIV infection", "concomitant")
- OR("HIV infection", "congenital immune deficiency diseases.")